Clinical trial exclusion criterion:
6. Body weight exceeding 150 Kg

Entity relations:
- Has_value("Body weight", "exceeding 150 Kg")